Clinical trial inclusion criterion:
Willing and able to participate in the study, including willing to go to the study pharmacy to obtain mifepristone

Annotated entities:
- Observation: "Willing and able to participate in the study"
- Observation: "willing to go to the study pharmacy"
- Drug: "mifepristone"
- Mood: "to obtain"